Clinical trial inclusion criterion:
planned to DAPT for 1 year after PCI

Annotated entities:
- Mood: "planned to"
- Procedure: "DAPT"
- Multiplier: "for 1 year"
- Temporal: "after PCI"
- Procedure: "PCI"
- Reference_point: "PCI"